daily chronic opioid use (over 3 months of continuous opioid use)

The above is a clinical trial exclusion criterion. Annotated with entity spans:
daily [Qualifier: chronic] [Drug: opioid] use ([Temporal: over 3 months] of continuous opioid use)